下列那一種狀況合併之糖尿病是由於胰島素分泌不足引起？
A. type A insulin resistance
B. leprechaunism
C. Rabson-Mendenhall syndrome
D. mutation(s) in insulin promoter factor-1（IPF-1）

正確答案：D. mutation(s) in insulin promoter factor-1（IPF-1）